氣味受器（odorant receptors）主要位於下列何處？
A. 嗅球（olfactory bulb）之毛叢狀細胞（tufted cells）上
B. 嗅球（olfactory bulb）之僧帽細胞（mitral cells）上
C. 嗅覺皮質（olfactory cortex）的感覺神經元上
D. 嗅覺上皮（olfactory epithelium）內的感覺神經元上

正確答案：D. 嗅覺上皮（olfactory epithelium）內的感覺神經元上